Si no consigo aprenderme mi nuevo número de teléfono ya que siempre me aparecen los tres primeros dígitos del antiguo, ¿cómo se denomina ese tipo de interferencia?
1. Proactiva.
2. Retroactiva.
3. Coactiva.
4. Reactiva.
5. Protoactiva.

Respuesta correcta: 1. Proactiva.